Clinical trial inclusion criterion:
Infertile lean women with PCOS as defined by the Rotterdam criteria.

Entity relations:
- Has_qualifier("Infertile", "Rotterdam criteria")
- AND("Infertile", "PCOS")